Clinical trial exclusion criterion:
4. An ulcer positive for β-hemolytic streptococci upon culture

Entity relations:
- Has_qualifier("ulcer", "positive for β-hemolytic streptococci")